Pregnant or nursing

The above is a clinical trial exclusion criterion. Annotated with entity spans:
[Condition: Pregnant] or [Condition: nursing]